A first degree relative (for example, mother, father, brother, sister) who had a heart condition before the age of 50

The above is a clinical trial exclusion criterion. Annotated with entity spans:
[Person: A first degree relative] (for example, [Person: mother], [Person: father], [Person: brother], [Person: sister]) who had a [Condition: heart condition] [Temporal: before the age of 50]